小新是個 5 個月大的小男孩，35 週自然生產，體重 2500 公克，生產過程順利，生長曲線及發展指標正常，但是最近兩個月來媽媽發現小新喝奶及哭鬧時會有奇怪的呼吸聲，若是俯臥休息時聲音會消失，帶到門診醫生檢查發現有吸氣性的喘鳴聲，請問他最有可能是下列那種診斷？
A. 聲門下狹窄（subglottic stenosis）
B. 軟喉症（laryngomalacia）
C. 兩側聲帶麻痺（bilateral vocal palsy）
D. 氣管軟化症（tracheomalacia）

正確答案：B. 軟喉症（laryngomalacia）